一位 20 歲男性因陰囊多處潰瘍達一個月而住院，過去兩年來病人常有口腔潰瘍、陰囊潰瘍，曾有大腸出血之現象；下列檢查最有助於診斷的是那一項？
A. 病態反應性皮膚測驗（pathergy test）
B. 全身電腦斷層掃描檢查（CT scan）
C. 免疫球蛋白電泳分析
D. 類風濕性因子（RF）

正確答案：A. 病態反應性皮膚測驗（pathergy test）